一女性具有45,XX,der(14;21)(q10;q10)之染色體組型。則下列敘述何者正確？
A. 此為典型之21三染色體症（Trisomy 21）
B. 此女性是唐氏症病人
C. 此女性之女兒有可能為46,XX,der(14;21)(q10;q10),+21之染色體組型
D. 此女性為不孕症患者

正確答案：C. 此女性之女兒有可能為46,XX,der(14;21)(q10;q10),+21之染色體組型